Clinical trial inclusion criterion:
diagnosis of stage II adhesive capsulitis as determined by clinical examination of the treating physician, and

Annotated entities:
- Qualifier: "stage II"
- Condition: "adhesive capsulitis"
- Qualifier: "as determined by clinical examination"
- Procedure: "clinical examination"